Señale la definición correcta:
1. El Número Necesario a Tratar (NNT) es el inverso del Riesgo Relativo (RR).
2. La Reducción del Riesgo Relativo (RRR) puede diferenciar claramente los riesgos y beneficios grandes de los pequeños.
3. La Reducción del Riesgo Relativo (RRR) es una medida del esfuerzo terapéutico que deben realizar clínicos y pacientes para evitar resultados negativos de sus enfermedades.
4. El Número Necesario a Dañar (NND) se calcula dividiendo la unidad entre el Número Necesario a Tratar (NNT).
5. La Reducción del Riesgo Absoluto (RRA) se calcula mediante la diferencia absoluta de la tasa de episodios en el grupo control menos la tasa de episodios en el grupo intervención.

Respuesta correcta: 5. La Reducción del Riesgo Absoluto (RRA) se calcula mediante la diferencia absoluta de la tasa de episodios en el grupo control menos la tasa de episodios en el grupo intervención.